3. Medications:

The above is a clinical trial exclusion criterion. Annotated with entity spans:
[Parsing_Error: 3.] Medications: